Clinical trial exclusion criterion:
Clinically significant findings on exam or ultrasound, such as salpingitis, hydrosalpynx or evidence of ovarian cysts

Entity relations:
- Has_mood("ovarian cysts", "evidence")
- Has_qualifier("findings", "Clinically significant")
- Has_context("exam", "findings")
- Subsumes("exam", "salpingitis")
- OR("salpingitis", "hydrosalpynx", "ovarian cysts")
- OR("exam", "ultrasound")